有關急性淋巴球性白血病（Acute lymphoid leukemia）之病人，下列何者為預後較佳之指標？
A. 病人年齡大於 10 歲
B. 周邊白血球數目超過 105/μL
C. 染色體數超過 50 個
D. 具有費城染色體（Philadelphia chromosome）

正確答案：C. 染色體數超過 50 個